Where in a protein can a signal sequence be found?

Proteins have signal sequences typically resent at the most N-terminal end.